下列何種突變會使轉譯（translation）過程中蛋白質的合成提前結束？
A. silent mutation
B. missense mutation
C. suppressor mutation
D. nonsense mutation

正確答案：D. nonsense mutation